La actividad peptidil transferasa está localizada en:
1. Nucleótidos del RNA 16S.
2. La subunidad 30S ribosomal.
3. La subunidad 50S ribosomal.
4. Las cadenas laterales de aminoácidos de proteínas de la subunidad grande.

Respuesta correcta: 3. La subunidad 50S ribosomal.